Clinical trial exclusion criterion:
HIV co-infection if on a protease inhibitor based regimen

Entity relations:
- AND("HIV co-infection", "protease inhibitor")